Señale la respuesta correcta respecto al tratamiento del trastorno esquizotípico de la personalidad:
1. El programa de tratamiento con mayor apoyo empírico para este trastorno es la terapia basada en la mentalización.
2. Pueden ser útiles estrategias terapéuticas que se utilizan para la esquizofrenia, dada la notable relación entre dos entidades clínicas.
3. El foco de tratamiento es la impulsividad característica de este trastorno.
4. El programa que más apoyo empírico ha recibido para este trastorno es la terapia dialéctica comportamental.
5. Para el tratamiento de este trastorno se utilizan las estrategias terapéuticas que se aplican al trastorno obsesivo-compulsivo.

Respuesta correcta: 2. Pueden ser útiles estrategias terapéuticas que se utilizan para la esquizofrenia, dada la notable relación entre dos entidades clínicas.